Known hypersensitivity to vaginal progesterone or its excipients

The above is a clinical trial exclusion criterion. Annotated with entity spans:
Known [Condition: hypersensitivity] to [Drug: vaginal progesterone] or its [Drug: excipients]